Patients minors

The above is a clinical trial exclusion criterion. Annotated with entity spans:
Patients [Person: minors]